下列關於甲狀腺眼病變的敘述，何者錯誤？
A. 好發於中年女性
B. 上直肌（superior rectus muscle）比其他眼外肌較早出現發炎及纖維化
C. 抽菸為甲狀腺眼病變的危險因子，故治療上也須要求病人戒煙
D. 是造成成人單眼凸眼症最常見的原因

正確答案：B. 上直肌（superior rectus muscle）比其他眼外肌較早出現發炎及纖維化